符合下列那一種狀況的癲癇病人，一定要接受腦部磁振造影或電腦斷層掃描？
A. 失神型小發作（absence petit mal）每天超過5次者
B. 癲癇在25歲之後才發病者
C. 良性Rolandic癲癇（benign Rolandic epilepsy）者
D. 小孩發燒痙攣（febrile seizure）者

正確答案：B. 癲癇在25歲之後才發病者